empyema.

The above is a clinical trial inclusion criterion. Annotated with entity spans:
[Condition: empyema].